La galantamina es un alcaloide::
1. Indolterpénico con actividad amebicida.
2. Derivado de las fenetilisoquinoleinas con actividad citotóxica.
3. De la familia Amaryllidaceae inhibidor de acetilcolinesterasa.
4. Tetrahidroisoquinoleico con actividad analgésica.

Respuesta correcta: 3. De la familia Amaryllidaceae inhibidor de acetilcolinesterasa.